Clinical trial exclusion criterion:
Expected life-span less than <1 year

Annotated entities:
- Observation: "Expected life-span"
- Value: "less than <1 year"